Age = 18 years and = 50 years

The above is a clinical trial inclusion criterion. Annotated with entity spans:
[Person: Age] [Value: = 18 years and = 50 years]